Patients with an allergy to oral vancomycin or fidaxomicin.

The above is a clinical trial exclusion criterion. Annotated with entity spans:
Patients with an [Condition: allergy] to [Qualifier: oral] [Drug: vancomycin] or [Drug: fidaxomicin].